Clinical trial exclusion criterion:
Patient suffers with other cardiac rhythm disorders.

Annotated entities:
- Condition: "cardiac rhythm disorders"
- Qualifier: "other"